Age > 18 Years

The above is a clinical trial exclusion criterion. Annotated with entity spans:
[Person: Age] [Value: > 18 Years]